Clinical trial inclusion criterion:
Age 65 years and older

Annotated entities:
- Person: "Age"
- Value: "65 years and older"